Clinical trial inclusion criteria:
ASA I, II, III presenting for ambulatory surgery to be performed under general anesthesia

Annotated entities:
- Measurement: "ASA"
- Value: "I"
- Value: "II"
- Value: "III"
- Procedure: "ambulatory surgery"
- Procedure: "general anesthesia"
- Qualifier: "under general anesthesia"